Intracranial pathology: tumor, arteriovenous fistula or aneurysm.

The above is a clinical trial exclusion criterion. Annotated with entity spans:
[Condition: Intracranial pathology]: [Condition: tumor], [Condition: arteriovenous fistula] or [Condition: aneurysm].